Clinical trial exclusion criteria:
Toxic epidermal necrolysis with SCORTEN 6 or 7 at admission
Hypercoagulable state
Cardiac or peripheral arterial disease
Active malignancy
Myelodysplastic syndrome or hematological malignancy
Fructose intolerance
Pregnancy
Patient refusal

Annotated entities:
- Condition: "Toxic epidermal necrolysis"
- Measurement: "SCORTEN"
- Value: "6 or 7"
- Temporal: "at admission"
- Reference_point: "admission"
- Condition: "Hypercoagulable state"
- Condition: "peripheral arterial disease"
- Condition: "disease Cardiac"
- Condition: "malignancy"
- Qualifier: "Active"
- Condition: "Myelodysplastic syndrome"
- Condition: "hematological malignancy"
- Condition: "Fructose intolerance"
- Drug: "Fructose"
- Pregnancy_considerations: "Pregnancy"
- Post-eligibility: "Patient refusal"